Clinical trial exclusion criteria:
Known hypersensitivity to statin
Treatment with statins during the past month prior to study.
Serum creatinine > 3 mg/dl
Significant liver disease: liver enzymes 2.5 folds the upper normal limit
Malignancy
Pregnancy or lactation

Annotated entities:
- Condition: "hypersensitivity"
- Drug: "statin"
- Drug: "statins"
- Temporal: "during the past month prior to study"
- Reference_point: "the past month prior to study"
- Measurement: "Serum creatinine"
- Value: "> 3 mg/dl"
- Condition: "liver disease"
- Measurement: "liver enzymes"
- Value: "2.5 folds the upper normal limit"
- Qualifier: "Significant"
- Condition: "Malignancy"
- Condition: "Pregnancy"
- Condition: "lactation"